Patients subject to a protection measure.

The above is a clinical trial exclusion criterion. Annotated with entity spans:
Patients [Condition: subject to a protection measure].